下列何者是蛋白質轉譯之起始胺基酸？
A. Leucine
B. Cysteine
C. Methionine
D. Tyrosine

正確答案：C. Methionine